Clinical trial exclusion criterion:
severe atrioventricular block (2nd and 3rd degree)

Entity relations:
- Subsumes("severe", "2nd degree")
- Has_qualifier("atrioventricular block", "severe")
- OR("2nd degree", "3rd degree")